What year was the first successful human heart transplant performed?

the first human heart transplant in 1967 was performed using a deceased donor heart,